一個 4 個月大，體重 4 公斤的男嬰，因為重覆抽筋（seizure）及低血鈣症，住進醫院的加護病房，自從出生後，他就常拉肚子，並有重覆且難以治癒的念珠菌（Candida）感染。身體檢查發現左胸骨下緣有第三度心雜音，您認為這位小朋友最好的治療方式為何？
A. 骨髓移植（bone marrow transplantation）
B. γ干擾素治療（interferon-gamma therapy）
C. 每月定期靜脈注射免疫球蛋白（monthly intravenous immunoglobulin infusions）
D. 胸腺移植（thymic transplantation）

正確答案：D. 胸腺移植（thymic transplantation）